Clinical trial exclusion criterion:
Inability to communicate in the preoperative period because of coma, profound dementia or language barrier;

Entity relations:
- Has_temporal("Inability to communicate", "preoperative period")
- Has_qualifier("dementia", "profound")
- AND("Inability to communicate", "coma")
- OR("coma", "dementia", "language barrier")